Patients with abnormal coagulation or any other contra-indication to use of standard biopsy in routine diagnostic endoscopic procedures

The above is a clinical trial exclusion criterion. Annotated with entity spans:
Patients with [Condition: abnormal coagulation] or any other [Condition: contra-indication] to use of [Procedure: standard biopsy] in routine [Procedure: diagnostic endoscopic procedures]